頸椎神經根病變（cervical radiculopathy）常起因於退化性頸椎病灶（degenerative cervical lesion），導致頸部及上肢麻痛、感覺異常（paresthesia），最常發生頸椎神經根壓迫症候群（root compression syndrome）為：
A. C3, C4
B. C4, C5
C. C5, C6
D. C6, C7

正確答案：D. C6, C7